Clinical trial inclusion criterion:
Chronic Insomnia disorder criteria according to the criteria of DMS- V ( American Psychiatric Association, 2013) and insomnia severity index > 15

Entity relations:
- Has_value("insomnia severity index", "> 15")
- Has_qualifier("Chronic Insomnia disorder", "criteria of DMS- V")
- AND("Chronic Insomnia disorder", "insomnia severity index")